What is caused by the ectopic expression of CTCF?

ectopic expression of CTCF in K562 cells led to growth retardation and promotion of differentiation into the erythroid lineage;